The CXCR2 receptor is targeted in cancer. Name five antagonists.

There are numerous CXCR2 receptor antagonists, such as SB225002, G31P, SCH-527123, AZ10397767, SCH-479833.